Coagulopathies diagnosed by a physician or report of capillary fragility (ex: bruises or bleedings without justifiable cause;

The above is a clinical trial exclusion criterion. Annotated with entity spans:
[Condition: Coagulopathies] diagnosed by a physician or report of [Condition: capillary fragility] (ex: [Condition: bruises] or [Condition: bleedings] [Qualifier: without justifiable cause];